下列何者不是胰臟癌常見的臨床症狀？
A. 體重減輕（weight loss）
B. 黃疸（jaundice）
C. 腹痛（pain）
D. 腹瀉（diarrhea）

正確答案：D. 腹瀉（diarrhea）